Clinical trial inclusion criterion:
Emergent/elective

Entity relations:
- OR("Emergent", "elective")